Clinical trial inclusion criterion:
5. Agrees to use double-barrier contraception during the study and for 30 days after discontinuation of study medication. Acceptable double-barrier methods are: male condom with spermicide; male condom with diaphragm; diaphragm containing spermicide plus additional intra-vaginal spermicide;

Annotated entities:
- Parsing_Error: "5."
- Non-query-able: "Agrees to use double-barrier contraception during the study and for 30 days after discontinuation of study medication."
- Post-eligibility: "Agrees to use double-barrier contraception during the study and for 30 days after discontinuation of study medication."
- Parsing_Error: "Acceptable double-barrier methods are: male condom with spermicide; male condom with diaphragm; diaphragm containing spermicide plus additional intra-vaginal spermicide;"
- Post-eligibility: "Acceptable double-barrier methods are: male condom with spermicide; male condom with diaphragm; diaphragm containing spermicide plus additional intra-vaginal spermicide;"